Clinical trial exclusion criterion:
Anemia (hemoglobin <8 g/dl)

Annotated entities:
- Condition: "Anemia"
- Measurement: "hemoglobin"
- Value: "<8 g/dl"